有關Paget氏變形性骨炎（Paget's disease of bone）的敘述，下列何者正確？
A. 病灶的骨吸收（resorption）明顯增強，而骨生成（formation）明顯降低
B. 可能與細菌感染（bacterial infection）有關
C. 尚未接受治療的患者，血清中鹼性磷酸酶（alkaline phosphatase）會顯著升高
D. 尚未接受治療的患者，尿液中羥基脯胺酸（hydroxyproline）會顯著降低

正確答案：C. 尚未接受治療的患者，血清中鹼性磷酸酶（alkaline phosphatase）會顯著升高